血管縫合技巧中，下列何者不是袖狀縫合技巧（sleeve technique）的缺點？
A. 易造成狹窄（stenosis）
B. 較易造成血栓（thrombus）
C. 易形成血管瘤（aneurysm formation）
D. 不適用於管徑不一致的血管縫合（size discrepant vessels）

正確答案：D. 不適用於管徑不一致的血管縫合（size discrepant vessels）